Clinical trial exclusion criterion:
history of gastric or duodenal ulcers

Annotated entities:
- Condition: "duodenal ulcers"
- Condition: "gastric ulcers"